Clinical trial exclusion criterion:
Current or planned incarceration or other involuntary detention

Entity relations:
- Has_temporal("incarceration", "Current")
- OR("Current", "planned")
- OR("incarceration", "involuntary detention")